Measurable metastatic disease (>1cm) in at least one site other than bone-only

The above is a clinical trial inclusion criterion. Annotated with entity spans:
[Qualifier: Measurable] [Condition: metastatic disease] ([Value: >1cm]) in [Value: at least one] [Qualifier: site other than bone-only]